Which molecules are inhibited by Gilteritinib?

Gilteritinib is a novel, dual FLT3/AXL inhibitor with promising early phase trial data for acute myeloid leukemia.